Clinical trial exclusion criterion:
Presence of systemic diseases;

Annotated entities:
- Condition: "systemic diseases"